一位 21 歲男性病人因長期多尿及夜尿至門診就診，血液檢查發現：鈉 158 mmol/L，鉀 3.7 mmol/L，氯 124 mmol/L，尿液檢查發現鈉 12 mmol/L，鉀 6 mmol/L，肌酸酐 32 mg/dL，滲透度 60 mosm/kg H2O，給予desmopressin（DDAVP）測試發現尿液滲透度上升至 500 mosm/kg H2O，下列何者為正確診斷？
A. 原發性多喝水症（Primary polydipsia）
B. 腎因性尿崩症（Nephrogenic diabetes insipidus）
C. 中樞性尿崩症（Central diabetes insipidus）
D. 滲透性利尿症（Osmotic diuresis）

正確答案：C. 中樞性尿崩症（Central diabetes insipidus）